Patients who have been previously treated with epothilone

The above is a clinical trial exclusion criterion. Annotated with entity spans:
Patients who have been [Temporal: previously] treated with [Drug: epothilone]